Able to Extubate

The above is a clinical trial inclusion criterion. Annotated with entity spans:
[Mood: Able to] [Procedure: Extubate]